Clinical trial inclusion criterion:
Patients scheduled for laser laryngeal surgery under general anesthesia with either Propofol or desflurane based technique.

Entity relations:
- AND("laser laryngeal surgery", "general anesthesia")
- AND("general anesthesia", "Propofol")
- Has_mood("laser laryngeal surgery", "scheduled")
- OR("Propofol", "desflurane")